Is eligible to receive comprehensive medical care from Garrison Petawawa

The above is a clinical trial inclusion criterion. Annotated with entity spans:
[Non-query-able: Is eligible to receive comprehensive medical care from Garrison Petawawa]